Clinical trial exclusion criterion:
Pregnant women or women planning to become pregnant

Annotated entities:
- Pregnancy_considerations: "Pregnant women or women planning to become pregnant"